Clinical trial exclusion criterion:
Females of childbearing potential who are pregnant, breast-feeding or intend to become pregnant or are not using adequate contraceptive methods

Entity relations:
- Has_qualifier("contraceptive methods", "adequate")
- Has_negation("adequate", "not")
- OR("childbearing potential", "intend to become", "contraceptive methods", "breast-feeding", "pregnant", "pregnant")